Clinical trial exclusion criterion:
Patients with tropical worm infection.

Annotated entities:
- Condition: "tropical worm infection"